The aged patients with bad heart and lung function.

The above is a clinical trial exclusion criterion. Annotated with entity spans:
The [Person: aged] patients with [Condition: bad heart] and lung function.